Clinical trial inclusion criterion:
Patient is currently benefiting from the treatment with nilotinib, as determined by the investigator

Annotated entities:
- Procedure: "treatment"
- Drug: "nilotinib"
- Non-representable: "as determined by the investigator"
- Temporal: "currently"